ECOG Performance Status of 0 or 1.

The above is a clinical trial inclusion criterion. Annotated with entity spans:
[Measurement: ECOG Performance Status] of [Value: 0 or 1].